Clinical trial exclusion criterion:
Prior transplant with stem cell infusion 90 days or active graft-versus-host treatment within 8 weeks of Day 1.

Entity relations:
- Has_temporal("graft-versus-host treatment", "within 8 weeks of Day 1")
- Has_temporal("transplant", "Prior")
- AND("transplant", "stem cell infusion")
- Has_temporal("transplant", "90 days of Day 1")
- Has_temporal("graft-versus-host treatment", "active")
- OR("transplant", "graft-versus-host treatment")